Severe previous reaction or reaction considered immunological, such as anaphylaxis, facial swelling, severe rash, muscle ache with rise in serum creatine kinase, inflammatory myopathy, rhabdomyolysis or liver function abnormalities (aspartate transaminase (AST) or alanine transaminase (ALT) greater than 3 times upper limit or normal).

The above is a clinical trial exclusion criterion. Annotated with entity spans:
Severe previous reaction or reaction considered immunological, such as [Condition: anaphylaxis], [Condition: facial swelling,] [Condition: severe rash], [Condition: muscle ache] with [Value: rise] in [Measurement: serum creatine kinase], [Condition: inflammatory myopathy], [Condition: rhabdomyolysis] or [Condition: liver function abnormalities] ([Measurement: aspartate transaminase] ([Measurement: AST]) or [Measurement: alanine transaminase] ([Measurement: ALT]) [Value: greater than 3 times upper limit or normal]).